Clinical trial exclusion criterion:
Heavily calcified or angulated lesion

Annotated entities:
- Qualifier: "Heavily calcified"
- Qualifier: "angulated"
- Condition: "lesion"